Other ocular pathologies that in the investigator's opinion would interfere with the subject's vision in the study eye.

The above is a clinical trial exclusion criterion. Annotated with entity spans:
[Qualifier: Other] [Condition: ocular pathologies] that [Non-query-able: in the investigator's opinion] [Observation: would interfere with the subject's vision in the study eye].